singleton pregnancy

The above is a clinical trial inclusion criterion. Annotated with entity spans:
[Qualifier: singleton] [Condition: pregnancy]